When did delafloxacin receive its first approval in the USA for acute bacterial skin and skin structure infections?

Delafoxacin received approval in the USA for the treatment of acute bacterial skin and skin structure infections in 2017.